Patients on perioperative intravenous (IV) steroids.

The above is a clinical trial exclusion criterion. Annotated with entity spans:
Patients on [Temporal: perioperative] [Drug: intravenous (IV) steroids].